What happens upon disruption of a TAD boundary?

Disruption of a TAD boundary causes ectopic chromosomal contacts and long-range transcriptional misregulation. In this way, disruptions of topological chromatin domains cause pathogenic rewiring of gene-enhancer interactions. This rewiring occurred only if the variant disrupted a CTCF-associated boundary domain.